La sulfasalazina se utiliza para el tratamiento de la colitis ulcerosa. Es un profármaco del ácido 5-aminosalicílico que se activa por un proceso de:
1. Hidrólisis de un éster.
2. Hidrólisis de una amida.
3. Desalquilación oxidativa.
4. Ruptura reductora del azoderivado.
5. Hidroxilación aromática.

Respuesta correcta: 4. Ruptura reductora del azoderivado.